Clinical trial exclusion criterion:
Subjects with high gastrointestinal bleeding risk, including the following conditions: local active ulcer lesions with positive fecal occult blood test (++); history of black stool, or vomiting blood in the past 3 months;unresected primary lesion in stomach with positive fecal occult blood test (+), ulcerated gastric carcinoma with massive alimentary tract bleeding risk judged by PIs based on gastric endoscopy result;

Entity relations:
- Has_qualifier("gastrointestinal bleeding risk", "high")
- Has_qualifier("ulcer lesions", "active")
- Has_value("fecal occult blood test", "positive")
- Has_temporal("black stool", "past 3 months")
- Has_qualifier("primary lesion", "stomach")
- Subsumes("positive", "++")
- Subsumes("positive", "+")
- Has_value("fecal occult blood test", "positive")
- Has_qualifier("bleeding risk", "alimentary tract")
- Has_qualifier("bleeding risk", "massive")
- Has_context("ulcerated gastric carcinoma", "bleeding risk")
- AND("primary lesion", "fecal occult blood test")
- AND("ulcer lesions", "fecal occult blood test")
- Subsumes("gastrointestinal bleeding risk", "ulcer lesions")
- OR("black stool", "vomiting blood")
- OR("ulcer lesions", "primary lesion", "black stool", "ulcerated gastric carcinoma")